Clinical trial inclusion criterion:
Normal baseline cardiac function based upon pre-operative evaluation

Entity relations:
- Has_value("cardiac function", "Normal")
- AND("cardiac function", "baseline")
- AND("cardiac function", "pre-operative evaluation")
- Has_temporal("pre-operative evaluation", "pre-operative")